Hombre de 49 años que consulta por poliuria y polidipsia intensas y pérdida involuntaria de 10 kg de peso y es diagnosticado de diabetes mellitus por una glucemia plasmática de 322 mg/dL y una hemoglobina glicosilada de 9,8%. Su médico le da recomendaciones dietéticas, la conveniencia de realizar ejercicio físico, e inicia tratamiento con metformina 850 mg/12 horas y glimepirida 6 mg/día. En las semanas siguientes los controles glucémicos se van reduciendo progresivamente. A los 4 meses la glucemia es de 94 mg/dL y la HbA1c de 5,9%. El paciente se queja de episodios frecuentes de mareo, dolor epigástrico, visión borrosa, sudoración y temblor, que mejoran comiendo algo y que ocurren sobre todo al final de la mañana y al final de la tarde. ¿Qué modificación propondría en su tratamiento?
1. Revisar la distribución de hidratos de carbono de su dieta.
2. Suspender la metformina.
3. Suspender la sulfonilurea.
4. Sustituir la metformina por un inhibidor de la DPP4.

Respuesta correcta: 3. Suspender la sulfonilurea.